Clinical trial inclusion criterion:
Age: ≥ 18 years

Entity relations:
- Has_value("Age", "≥ 18 years")